Clinical trial exclusion criterion:
Patient has both clinically significant findings and unexplained clinically significant alarm symptoms

Entity relations:
- Has_qualifier("clinically significant alarm symptoms", "unexplained")